Clinical trial inclusion criterion:
Patients weighing = 80 pounds who are not -intubated prior to surgery,

Entity relations:
- multi("surgery", "surgery")
- Has_index("prior to surgery", "surgery")
- Has_temporal("intubated", "prior to surgery")
- Has_negation("intubated", "not")
- Has_value("weighing", "= 80 pounds")